What virus is the  Gardisil vaccine used for?

Gardisil is a 4-component vaccine against capsular HPV 16 (4C HPV16), which has recently been licensed in Europe, Canada and Australia.